Clinical trial exclusion criterion:
hypoglycemia SE;psychogenic SE;any other pseudo-SE

Annotated entities:
- Condition: "hypoglycemia SE"
- Condition: "psychogenic SE"
- Condition: "pseudo-SE"